Clinical trial exclusion criterion:
Contraindication to regional anesthesia e.g. bleeding diathesis, coagulopathy

Annotated entities:
- Condition: "Contraindication"
- Procedure: "regional anesthesia"
- Condition: "bleeding diathesis"
- Condition: "coagulopathy"